In which syndrome is the RPS19 gene most frequently mutated?

Among these patients, RPS19 was the most frequently mutated gene. It has been proven that defects of ribosomal proteins can lead to this disease and that RPS19 is the most frequently mutated gene in DBA patients. Mutations in the ribosomal protein S19 gene (RPS19) have been found in 25% of patients with Diamond-Blackfan anemia, a rare syndrome of congenital bone marrow failure characterized by erythroblastopenia and various malformations. The association of mental retardation with large deletions at the 19q locus points to a contiguous gene syndrome. Analysis of pre-rRNA processing in primary DBA lymphoblastoid cell lines demonstrated similar alterations of large ribosomal subunit rRNA in both RPL35A-mutated and some RPL35A wild-type patients, suggesting additional large ribosomal subunit gene defects are likely present in some cases of DBA. No genotype-phenotype correlation has been found so far in RPS19 mutated patients. Hematologic findings, malformations and outcome are similar in the RPS19 mutated and the non-mutated groups. Recent reports show that the ribosomal protein S19 (RPS19) gene is mutated in 25% of all patients with DBA.